Clinical trial inclusion criterion:
A positive 13 C-urea breath test

Annotated entities:
- Measurement: "13 C-urea breath test"
- Value: "positive"